Clinical trial exclusion criterion:
Can't express his complain correctly and can't cooperate with the researcher

Annotated entities:
- Non-query-able: "Can't express his complain correctly and can't cooperate with the researcher"